下列關於青春期特發性脊椎側彎（adolescent idiopathic scoliosis）的敘述，何者錯誤？
A. 流行率約為 2～3%
B. 小幅度的側彎（10 度左右），男女發生率差不多
C. 較大幅度的側彎（大於 30 度），女生約為男生的十倍多
D. 胸椎側彎通常凸側在左邊（convex to the left）

正確答案：D. 胸椎側彎通常凸側在左邊（convex to the left）